Clinical trial exclusion criterion:
Has received prior immunotherapy with an anti-Programmed Cell Death Receptor 1 (PD-1), Programmed Cell Death Receptor Ligand 1 (anti-PD-L1), or anti- Programmed Cell Death Receptor Ligand 2 (PD-L2) or has previously participated in clinical studies with pembrolizumab

Annotated entities:
- Procedure: "immunotherapy"
- Drug: "anti-Programmed Cell Death Receptor 1 (PD-1)"
- Drug: "Programmed Cell Death Receptor Ligand 1 (anti-PD-L1)"
- Drug: "anti- Programmed Cell Death Receptor Ligand 2 (PD-L2)"
- Non-query-able: "participated in clinical studies with pembrolizumab"
- Drug: "pembrolizumab"
- Observation: "participated in clinical studies with pembrolizumab"